Clinical trial exclusion criterion:
Patient's pregnant or breast-feeding or child-bearing potential

Entity relations:
- OR("pregnant", "breast-feeding", "child-bearing potential")